La heterocromatina:
1. Está poco condensada (fibras de 30-60nm)
2. Es transcripcionalmente activa.
3. Contiene secuencias de DNA altamente repetitivas.
4. Se dispone alrededor del complejo de poro nuclear.

Respuesta correcta: 3. Contiene secuencias de DNA altamente repetitivas.